Hypersensitivity to everolimus, sirolimus, or other rapamycin deriviatives

The above is a clinical trial exclusion criterion. Annotated with entity spans:
[Condition: Hypersensitivity] to [Drug: everolimus], [Drug: sirolimus], or other [Drug: rapamycin] deriviatives